El paso más lento y determinante de la velocidad de reacción en la sustitución unimolecular es la disociación del enlace C-X, en que se forma un intermedio:
1. Carbocatiónico.
2. Carbaniónico.
3. Carbeno.
4. Radicálico.

Respuesta correcta: 1. Carbocatiónico.